Clinical trial exclusion criterion:
Use of monoamine oxidase inhibitors 21 days prior to study

Entity relations:
- Has_temporal("monoamine oxidase inhibitors", "21 days prior to study")
- Has_index("21 days prior to study", "study")